Clinical trial exclusion criterion:
Acute abdomen, patient who has diagnosed paralytic ileus or suspicious ileus

Annotated entities:
- Condition: "Acute abdomen"
- Condition: "paralytic ileus"
- Condition: "suspicious ileus"